Clinical trial exclusion criterion:
8. Immunosuppressants: cyclosporin, everolimus, sirolimus

Entity relations:
- OR("cyclosporin", "sirolimus", "everolimus")